Clinical trial inclusion criterion:
Patients diagnosed with acromegaly with GH-secreting pituitary adenoma on sellar MRI, meeting the biochemical criteria outlined above (refer to 1. Diagnosis of acromegaly) and with typical acromegalic features.

Entity relations:
- AND("sellar MRI", "GH-secreting pituitary adenoma")
- AND("acromegaly", "sellar MRI")
- Has_qualifier("acromegaly", "biochemical criteria outlined above")
- Has_qualifier("acromegalic features", "typical")